Intestinal infection within 2 months before study entry.

The above is a clinical trial exclusion criterion. Annotated with entity spans:
[Condition: Intestinal infection] [Temporal: within 2 months before study entry].